El concepto de esquema latente en la teoría cognitiva de la depresión de Aaron Beck significa que son esquemas cognitivos:
1. De los que el individuo no es consciente.
2. Que influyen directamente en el estado de ánimo de un modo continuo pero sutil.
3. Que no están permanente activados en los individuos vulnerables y se activan sólo frente a estresores específicos.
4. Que están activos de modo permanente pero con una intensidad que se incrementa en cada recaída o recurrencia.
5. Que no requieren esfuerzo mental para su activación.

Respuesta correcta: 3. Que no están permanente activados en los individuos vulnerables y se activan sólo frente a estresores específicos.